Clinical trial inclusion criterion:
9. >18 years of age.

Annotated entities:
- Value: ">18 years"
- Person: "age"